Women of childbearing age without reliable contraception

The above is a clinical trial exclusion criterion. Annotated with entity spans:
[Person: Women] of [Person: childbearing age] [Negation: without] [Qualifier: reliable] [Procedure: contraception]